Licensed nursing home in Orange County or Southern Los Angeles County serving adults

The above is a clinical trial inclusion criterion. Annotated with entity spans:
[Visit: Licensed nursing home] in [Visit: Orange County] or [Visit: Southern Los Angeles County] [Qualifier: serving adults]